Pathologically altered level of any serum electrolyte (sodium, potassium, magnesium, calcium, chloride, phosphate) unless corrected prior to the start of study treatment

The above is a clinical trial exclusion criterion. Annotated with entity spans:
[Value: Pathologically altered] [Measurement: level of any serum electrolyte] ([Measurement: sodium], [Measurement: potassium], [Measurement: magnesium], [Measurement: calcium], [Measurement: chloride], [Measurement: phosphate]) [Non-representable: unless corrected prior to the start of study treatment]